Clinical trial exclusion criterion:
With 3-4 grad Allergy to any drug in the treatment

Annotated entities:
- Qualifier: "3-4 grad"
- Condition: "Allergy"
- Drug: "drug"
- Qualifier: "any"